Wilson's disease 的成因是由於何者沈積過量？
A. 鐵
B. 銅
C. 銀
D. 鎂

正確答案：B. 銅